History of malignant arrhythmias

The above is a clinical trial exclusion criterion. Annotated with entity spans:
[Temporal: History] of [Condition: malignant arrhythmias]